Prior chemotherapy Prior treatment with gefitinib, erlotinib, or other drugs that target EGFR Patients must not be receiving any other investigational agents Any evidence of interstitial lung disease

The above is a clinical trial exclusion criterion. Annotated with entity spans:
[Line: Prior chemotherapy] [Line: Prior treatment with gefitinib, erlotinib, or other drugs that target EGFR] [Post-eligibility: Patients must not be receiving any other investigational agents] Any evidence of [Condition: interstitial lung disease]